Clinical trial inclusion criterion:
ASA I - II

Entity relations:
- Has_value("ASA", "I - II")